Clinical trial exclusion criterion:
require prednisone, methotrexate, or other immunosuppressing medications

Annotated entities:
- Drug: "prednisone"
- Drug: "methotrexate"
- Drug: "immunosuppressing medications"
- Qualifier: "other"